Clinical trial exclusion criterion:
polycystic ovaries

Annotated entities:
- Condition: "polycystic ovaries"